關於褥瘡的分級，下列敘述何者錯誤？
A. 第一級，皮膚完整但出現下壓不會反白的發紅區
B. 第二級，部分皮層缺損，呈現表淺性潰瘍，臨床上可看到擦傷、水泡、淺的火山口狀傷口
C. 第三級，部分皮層缺損，可看到組織被破壞與壞死
D. 第四級，全皮層缺損，可看到組織被嚴重破壞與壞死，壞死深及肌肉層、骨骼、支持性結構

正確答案：C. 第三級，部分皮層缺損，可看到組織被破壞與壞死